Clinical trial inclusion criterion:
Planned non-cardiac surgery at least after 12 months of implantation of drug eluting stent

Entity relations:
- AND("implantation", "drug eluting stent")
- multi("implantation of drug eluting stent", "implantation")
- Has_index("at least after 12 months of implantation of drug eluting stent", "implantation of drug eluting stent")
- Has_temporal("non-cardiac surgery", "at least after 12 months of implantation of drug eluting stent")
- Has_mood("non-cardiac surgery", "Planned")